Clinical trial inclusion criterion:
Agrees to wear a head mounted display (HMD) for up to 45 minutes

Entity relations:
- AND("Agrees to wear", "head mounted display (HMD)")
- Has_temporal("Agrees to wear", "for up to 45 minutes")